有關蕈狀肉芽腫（mycosis fungoides）的敘述，下列何者錯誤？
A. 是一種黴菌感染症
B. 是皮膚的 T-cell 淋巴瘤
C. 皮疹可由斑塊進展為腫瘤
D. 可演變成西紮利症（Sézary syndrome），而發生紅皮症（erythroderma）

正確答案：A. 是一種黴菌感染症